Clinical trial inclusion criterion:
= 18 years

Entity relations:
- Has_value("= 18 years", "= 18 years")